With evidence of intrinsic sphincter deficiency as defined by a maximal urethral closure pressure of <20 cm H2O

The above is a clinical trial exclusion criterion. Annotated with entity spans:
With evidence of [Condition: intrinsic sphincter deficiency] as defined by a [Measurement: maximal urethral closure pressure] of [Value: <20 cm H2O]